Currently pregnant

The above is a clinical trial exclusion criterion. Annotated with entity spans:
Currently [Condition: pregnant]